Clinical trial inclusion criterion:
Women of childbearing age will be required to have a negative pregnancy test at enrollment and use birth control throughout the duration of treatment.

Annotated entities:
- Pregnancy_considerations: "Women of childbearing age will be required to have a negative pregnancy test at enrollment and use birth control throughout the duration of treatment."